下列何者在臨床上會表現不正常出血狀況？
A. 肝素引起之血小板過低症
B. 抗磷脂症候群
C. 蛋白質 C 缺乏症
D. 第八因子抗體

正確答案：D. 第八因子抗體